Clinical trial exclusion criterion:
Other significant medical conditions that could increase the risk to the subject.

Annotated entities:
- Non-query-able: "Other significant medical conditions that could increase the risk to the subject"